Clinical trial inclusion criteria:
Men and women aged 18-45 years.
Diagnosis of functional dyspepsia, based on the Rome IV criteria (2016).
GIS score of at least 6.
Negative H. pylori test .
Availability of a signed patient information sheet (Informed Consent form) for participation in the clinical trial.
Patients who agree to use an effective method of contraception throughout the clinical trial.

Annotated entities:
- Person: "Men"
- Person: "women"
- Person: "aged"
- Value: "18-45 years"
- Condition: "functional dyspepsia"
- Measurement: "Rome IV criteria (2016)"
- Measurement: "GIS score"
- Value: "at least 6"
- Measurement: "H. pylori test"
- Value: "Negative"
- Post-eligibility: "Availability of a signed patient information sheet (Informed Consent form) for participation in the clinical trial"
- Pregnancy_considerations: "Patients who agree to use an effective method of contraception throughout the clinical trial."